Patient has left ventricular ejection fraction (LVEF) less than 35% not secondary to tachycardia.

The above is a clinical trial exclusion criterion. Annotated with entity spans:
Patient has [Measurement: left ventricular ejection fraction] ([Measurement: LVEF]) [Value: less than 35%] [Mood: not secondary to] [Condition: tachycardia].